Las tiazidas (p.ej. hidroclorotiazida) empleadas como diuréticos son sulfonamidas primarias o sulfamidas no sustituidas relacionadas estructuralmente con:
1. Derivados de 1,2,4-benzotiadiazinas.
2. Derivados de la quinazolin-4-ona.
3. Derivados del ácido antranílico.
4. Derivados de 1,3,4-tiadiazoles.

Respuesta correcta: 1. Derivados de 1,2,4-benzotiadiazinas.